Gastrointestinal disease or with gastrointestinal surgical history which can affect the absorption of the investigational product.

The above is a clinical trial exclusion criterion. Annotated with entity spans:
[Condition: Gastrointestinal disease] or with [Temporal: gastrointestinal surgical history] which can [Qualifier: affect the absorption of the investigational product].